Clinical trial inclusion criterion:
Patient must not have had a corticosteroid injection in the SI joint within the last three months

Entity relations:
- Has_qualifier("corticosteroid injection", "SI joint")
- Has_temporal("corticosteroid injection", "within the last three months")
- Has_negation("corticosteroid injection", "not")